Clinical trial exclusion criterion:
type 1 diabetes,specific types of diabetes,gestational diabetes or pregestational diabetes;

Entity relations:
- Has_qualifier("diabetes", "specific types")
- OR("type 1 diabetes", "pregestational diabetes", "diabetes", "gestational diabetes")